3. Surface ulcer with an area > 15cm2 post debridement

The above is a clinical trial inclusion criterion. Annotated with entity spans:
[Parsing_Error: 3.] [Condition: Surface ulcer] with an [Measurement: area] [Value: > 15cm2] post debridement